Clinical trial exclusion criterion:
Women of child bearing potential must be practicing effective contraception implemented during the trial and for at least 28 days following the last dose of study medication

Annotated entities:
- Person: "Women"
- Condition: "child bearing potential"
- Qualifier: "effective"
- Procedure: "contraception"
- Temporal: "during the trial"
- Temporal: "for at least 28 days following the last dose of study medication"
- Multiplier: "last dose"
- Drug: "study medication"
- Reference_point: "the last dose of study medication"